一位 56 歲女性，晚上八點至急診，主訴從當天上午十時左右開始右下腹疼痛。經診斷為急性闌尾炎後，你建議她接受腹腔鏡闌尾切除術或傳統闌尾切除手術。下列那一項相關敘述最正確？
A. 腹腔鏡術後，較易發生腹腔內膿瘍合併症
B. 腹腔鏡手術時間比較短，術後可較快恢復進食
C. 腹腔鏡手術，較易發生術後傷口感染
D. 傳統闌尾切除手術醫療費用比較高

正確答案：A. 腹腔鏡術後，較易發生腹腔內膿瘍合併症